Pulse oximetry（SpO2）為最普遍的生理監測，關於pulse oximetry的敘述，下列何者正確？
A. SpO2可以提供一個連續性、非侵入性的監測，且不受指甲顏色的影響
B. SpO2主要靠oxyhemoglobin（O2Hb）和deoxyhemoglobin（deO2Hb）在紅光（波長660nm）與遠紅外線
C. 一氧化碳中毒時Carboxyhemoglobin（COHb）會使SpO2的數值低於SaO2，造成誤判
D. SpO2是預測SaO2的方法，SpO2大於90%時，代表組織一定無缺氧狀況

正確答案：B. SpO2主要靠oxyhemoglobin（O2Hb）和deoxyhemoglobin（deO2Hb）在紅光（波長660nm）與遠紅外線